Patients with surgical or medical intestinal diseases or having received surgeries that could interfere with drug absorption distribution, metabolism and elimination

The above is a clinical trial exclusion criterion. Annotated with entity spans:
Patients with [Qualifier: surgical] or [Qualifier: medical] [Condition: intestinal diseases] or having received [Procedure: surgeries] that [Qualifier: could interfere with drug absorption distribution], metabolism and elimination